Any disorder that may interfere with drug absorption

The above is a clinical trial exclusion criterion. Annotated with entity spans:
Any [Condition: disorder] that [Qualifier: may interfere with drug absorption]